Clinical trial exclusion criterion:
HIV infection.

Annotated entities:
- Condition: "HIV infection"